Prior stroke

The above is a clinical trial exclusion criterion. Annotated with entity spans:
[Temporal: Prior] [Condition: stroke]